El complemento se produce mayoritariamente en:
1. Linfocitos.
2. Ganglios linfáticos.
3. Timo.
4. Bazo.
5. Hígado.

Respuesta correcta: 5. Hígado.